Clinical trial exclusion criterion:
Subject has severe arterial insufficiency of the legs (Screening on physical examination= patients with diminution or absence of dorsalis pedis or posterior tibialis pulses. If diminished or absent by palpation, then an arterial ultrasound is required with vascular plethysmography. If the absolute arterial pressure is below 50mm of Hg at the calf or ankle level, then the patient is to be excluded) or other peripheral vascular disease).

Entity relations:
- Has_qualifier("arterial insufficiency", "legs")
- Has_qualifier("arterial insufficiency", "severe")
- Subsumes("arterial ultrasound", "vascular plethysmography")
- Has_value("absolute arterial pressure", "below 50mm of Hg")
- Has_qualifier("absolute arterial pressure", "calf level")
- Has_context("palpation", "diminished")
- AND("palpation", "arterial ultrasound")
- AND("diminution or absence of dorsalis pedis", "Screening on physical examination")
- AND("Screening on physical examination", "palpation")
- Has_negation("absolute arterial pressure", "excluded")
- OR("diminution or absence of dorsalis pedis", "diminution or absence of posterior tibialis pulses")
- OR("calf level", "ankle level")
- OR("diminished", "absent")
- OR("palpation", "absolute arterial pressure", "peripheral vascular disease")